Clinical trial inclusion criteria:
Diagnosis of dyslipidemia: The existence of a previous clinical diagnostic of dyslipidemia associated with lipid-lowering therapy. It is also considered patients who have an altered analytical, using the following cutoffs: total cholesterol = 200 mg / dl, triglycerides = 180 mg / dl, HDL-cholesterol = 40 mg / dl or LDL-cholesterol = 150 mg / dl. Lipid-lowering treatment and diet, stable in the last month.
A concentration of LDL-cholesterol above 100 mg / dl, in the month prior to inclusion.
An apnea-hypopnea index between 5-30 h-1

Annotated entities:
- Condition: "dyslipidemia"
- Procedure: "lipid-lowering therapy"
- Measurement: "total cholesterol"
- Value: "= 200 mg / dl"
- Measurement: "triglycerides"
- Value: "= 180 mg / dl"
- Measurement: "HDL-cholesterol"
- Value: "= 40 mg / dl"
- Measurement: "LDL-cholesterol"
- Value: "= 150 mg / dl"
- Procedure: "Lipid-lowering treatment"
- Procedure: "Lipid-lowering diet"
- Qualifier: "stable"
- Temporal: "in the last month"
- Condition: "altered analytical"
- Condition: "dyslipidemia"
- Measurement: "LDL-cholesterol"
- Value: "above 100 mg / dl"
- Temporal: "in the month prior to inclusion"
- Reference_point: "inclusion"
- Measurement: "apnea-hypopnea index"
- Value: "between 5-30 h-1"